Clinical trial exclusion criterion:
Oral hypoglycemic or hormonal therapy either currently or in the preceding 3 months.

Entity relations:
- Has_qualifier("hypoglycemic therapy", "Oral")
- Has_temporal("hypoglycemic therapy", "preceding 3 months")
- OR("hypoglycemic therapy", "hormonal therapy")